Women of child bearing potential must be practicing effective contraception implemented during the trial and for at least 28 days following the last dose of study medication

The above is a clinical trial exclusion criterion. Annotated with entity spans:
[Person: Women] of [Condition: child bearing potential] must be practicing [Qualifier: effective] [Procedure: contraception] implemented [Temporal: during the trial] and [Temporal: for at least 28 days following the last dose of study medication]